Central nervous system aneurysm clip

The above is a clinical trial exclusion criterion. Annotated with entity spans:
[Device: Central nervous system aneurysm clip]